一位 53 歲男性來院接受身體檢查，過去無重大疾病史，父親於 74 歲時死於心臟病，母親現年 80 歲有高血壓病史，他不抽菸、不喝酒也沒有定期運動。血壓 128/84 mmHg，脈搏 80 次/分鐘，身高 170 公分，體重 82 公斤，理學檢查無特殊異常。你會建議他做下列那一種篩檢？
A. 攝護腺癌
B. 肺癌
C. 腹主動脈瘤
D. 大腸癌

正確答案：D. 大腸癌